Clinical trial exclusion criterion:
PI deems unfit to participate

Annotated entities:
- Non-query-able: "PI deems unfit to participate"